Mild to moderate tear film dysfunction clinical diagnose

The above is a clinical trial inclusion criterion. Annotated with entity spans:
[Qualifier: Mild] to [Qualifier: moderate] [Condition: tear film dysfunction] clinical diagnose